Age: 14-80 years

The above is a clinical trial inclusion criterion. Annotated with entity spans:
[Person: Age]: [Value: 14-80 years]